謝先生是一位 42 歲貿易公司基層員工，因被公司遣散，在隱蔽的山區隧道內自焚。全身煙燻污黑的謝先生由救護車運送至醫院。謝先生一直大喊著『好痛！好渴！』，診察發現，心跳每分鐘 162 下，呼吸速率每分鐘 26 次，血壓 70/35 mmHg，全身都是三度燒傷，體無完膚，右側腕部撓動脈摸不到脈搏。您認為對謝先生而言，下列處置何者應該最優先進行？
A. 建立輸液管道
B. 放置留存式導尿管
C. 放置連續性心電圖監測裝置
D. 放置連續性動脈壓監測裝置

正確答案：A. 建立輸液管道